Inability to obtain consent

The above is a clinical trial exclusion criterion. Annotated with entity spans:
[Post-eligibility: Inability to obtain consent]